Clinical trial exclusion criterion:
Patients with Impaired Renal Function with a have a known estimated CrCl<30 ml/min

Entity relations:
- Has_value("estimated CrCl", "<30 ml/min")